Clinical trial inclusion criterion:
The diagnosis of community-acquired pneumoniae

Annotated entities:
- Condition: "community-acquired pneumoniae"